Clinical trial inclusion criterion:
Absolute neutrophil count (ANC) greater than or equal to 500/mm^3

Entity relations:
- Has_value("Absolute neutrophil count (ANC)", "greater than or equal to 500/mm^3")